Clinical trial inclusion criterion:
Patients undergoing a loop ileostomy closure

Annotated entities:
- Procedure: "loop ileostomy closure"